Women of child-bearing potential

The above is a clinical trial exclusion criterion. Annotated with entity spans:
[Person: Women] of [Condition: child-bearing potential]